Severe cardiac disease, including New York Heart Association Class III or IV congestive heart failure, clinically significant aortic stenosis, history of cardiac arrest, use of a cardiac defibrillator, or uncontrolled angina

The above is a clinical trial exclusion criterion. Annotated with entity spans:
[Qualifier: Severe] [Condition: cardiac disease], including [Qualifier: New York Heart Association Class III or IV] [Condition: congestive heart failure], [Qualifier: clinically significant] [Condition: aortic stenosis], [Temporal: history] of [Condition: cardiac arrest], use of a [Device: cardiac defibrillator], or [Condition: uncontrolled angina]